Clinical trial exclusion criterion:
drug or alcohol abuse

Entity relations:
- OR("drug abuse", "alcohol abuse")